Clinical trial inclusion criterion:
Ejection fraction = 50%, no severe arrhythmia.

Annotated entities:
- Measurement: "Ejection fraction"
- Value: "= 50%"
- Negation: "no"
- Qualifier: "severe"
- Condition: "arrhythmia"